Una de las complicaciones más graves en los pacientes con Nutrición Enteral es la aspiración. De las siguientes medidas, ¿podría indicar cuál es la adecuada para su prevención?:
1. Utilizar solo alimentos a temperatura ambiente.
2. Administrar solamente a pacientes portadores de Sonda Sengstakenblakemore.
3. Colocar al paciente en posición SemiFowler.
4. Colocar al paciente en posición Trendelemburg.

Respuesta correcta: 3. Colocar al paciente en posición SemiFowler.